If HBV DNA is negative, the subject may be included but must undergo HBV DNA PCR testing monthly x 3 months beginning from the start of treatment

The above is a clinical trial inclusion criterion. Annotated with entity spans:
If [Measurement: HBV DNA] is [Value: negative], the subject may be included but [Non-query-able: must undergo HBV DNA PCR testing monthly x 3 months beginning from the start of treatment]